no consent

The above is a clinical trial exclusion criterion. Annotated with entity spans:
[Informed_consent: no consent]